¿Qué enzima es responsable de la conversión de nucleótidos en desoxinucleótidos?:
1. Ribonucleótido oxidasa.
2. Ribonucleótido deshidratasa.
3. Ribonucleótido deshidrogensasa.
4. Ribonucleótido reductasa.

Respuesta correcta: 4. Ribonucleótido reductasa.